What is the mechanism of action of ocrelizumab for treatment of multiple sclerosis?

Ocrelizumab is a cytolytic monoclonal antibody that binds CD20 antigen present of B cells. It is approved for treatment of multiple sclerosis.